A SLEDAI score is associated with Systemic Lupus Erythematosus. What is a SLEDAI score?

A complete Systemic Lupus Erythematosus Disease Activity Index (SLEDAI) score was obtained for each patient.